Clinical trial inclusion criterion:
mild gastrointestinal symptom

Annotated entities:
- Condition: "gastrointestinal symptom"
- Qualifier: "mild"